Serum creatinine of < 1.5 ULN or calculated CrCl of > 50 mL/min

The above is a clinical trial inclusion criterion. Annotated with entity spans:
[Measurement: Serum creatinine] of [Value: < 1.5 ULN] or [Measurement: calculated CrCl] of [Value: > 50 mL/min]